Have a CD4 cell count greater than 50 cells/mm3if not taking ART. Persons with cd4 < 50 may be enrolled, if it is felt that in the best interest of the patient, that enrollment in the study will allow for quicker initiation of antiretroviral therapy than referral to another treatment center.

The above is a clinical trial inclusion criterion. Annotated with entity spans:
Have a [Measurement: CD4 cell count] [Value: greater than 50 cells/mm3]if [Negation: not] taking [Procedure: ART]. Persons with cd4 < 50 may be enrolled, if it is felt that in the best interest of the patient, that enrollment in the study will allow for quicker initiation of antiretroviral therapy than referral to another treatment center.